indication for catheter insertion;

The above is a clinical trial exclusion criterion. Annotated with entity spans:
[Mood: indication] for [Procedure: catheter insertion];